Clinical trial exclusion criterion:
Patients who have received a drug-eluting stent (DES) procedure within the past 6 months

Annotated entities:
- Procedure: "drug-eluting stent procedure"
- Procedure: "DES"
- Temporal: "past 6 months"